Clinical trial exclusion criterion:
Clinically significant current Axis II (DSM-IV-TR) diagnosis

Annotated entities:
- Qualifier: "Axis II"
- Condition: "diagnosis"
- Qualifier: "DSM-IV-TR"